Clinical trial exclusion criterion:
previous lower abdominal surgery with an abnormal micturition

Entity relations:
- Has_qualifier("micturition", "abnormal")